有關中央極限定理（Central limit theorem）的敘述，何者錯誤？
A. 只要樣本數夠大，樣本平均數的分布就會趨近常態分布
B. 只要樣本數夠大，樣本平均數分布的期望值會很接近母體平均數
C. 只要樣本數超過 1，樣本平均數分布的標準差都會小於母體標準差
D. 母體分布只有在常態分布時，樣本數夠大時樣本平均數的分布才會趨近常態分布

正確答案：D. 母體分布只有在常態分布時，樣本數夠大時樣本平均數的分布才會趨近常態分布